52歲女性患者，半年來有間歇性心悸、冒冷汗、頭痛、血壓突然升高到約180/100 mmHg的情況，下列何種內分泌疾病最需要列入診斷考量？
A. 嗜鉻細胞瘤（pheochromocytoma）
B. 甲狀腺功能亢進（hyperthyroidism）
C. 庫欣氏症（Cushing's syndrome）
D. 原發性醛固酮過高症（primary aldosteronism）

正確答案：A. 嗜鉻細胞瘤（pheochromocytoma）